Clinical trial inclusion criterion:
Subjects were to have a negative screen for HIV I and II, HBsAg, and antibody to Hepatitis C virus.

Annotated entities:
- Measurement: "screen for HIV I"
- Measurement: "screen for HIV II"
- Value: "negative"
- Measurement: "HBsAg"
- Measurement: "antibody to Hepatitis C virus"